7 歲男孩因腹痛至急診，主訴 24 小時前出現右下腹痛，隨後發生嘔吐及輕微發燒，男孩完全無胃口，亦無腹瀉，4 小時前腹痛擴展至全腹部且略為腫脹，身體診查發現男孩中度脫水、腸音消失、整個腹部皆有反彈痛（rebound tenderness）。最應優先考慮的診斷為下列何者？
A. 急性腸胃炎（acute gastroenteritis）
B. 急性闌尾炎（acute appendicitis）
C. 急性腸繫膜淋巴腺炎（acute mesenteric lymphadenitis）
D. 急性腎盂腎炎（acute pyelonephritis）

正確答案：B. 急性闌尾炎（acute appendicitis）